下列有關 omeprazole 之敘述，何者錯誤？
A. proton pump 抑制劑
B. 抑制胃酸分泌之作用持久
C. 改善 gastrin 引發之胃食道逆流（gastro-esophageal reflux）
D. 其與 H+, K+-ATPase 之結合作用屬於可逆性

正確答案：D. 其與 H+, K+-ATPase 之結合作用屬於可逆性